Clinical trial exclusion criterion:
2. Best corrected visual acuity (BCVA) at baseline <20/200.

Annotated entities:
- Parsing_Error: "2."
- Measurement: "Best corrected visual acuity (BCVA)"
- Value: "<20/200"
- Temporal: "at baseline"
- Reference_point: "baseline"